Indique cuál de los siguientes déficits es una alteración del metabolismo de los mucopolisacáridos:
1. Déficit de piruvato quinasa.
2. Déficit de enzima ramificante.
3. Déficit de esfingomielinasa.
4. Déficit de N-acetilneuraminidasa.
5. Déficit de N-acetilglucosaminidasa.

Respuesta correcta: 5. Déficit de N-acetilglucosaminidasa.